Clinical trial exclusion criterion:
Retransplantation

Annotated entities:
- Condition: "Retransplantation"